Which gene is responsible for proper speech development?

The Key Regulator for Language and Speech Development, FOXP2, is a Novel Substrate for SUMOylation.